Clinical trial exclusion criterion:
A bad reaction to AZD5363 or any drugs similar to it in structure or class

Annotated entities:
- Condition: "bad reaction to AZD5363"
- Drug: "AZD5363"
- Context_Error: "A bad reaction to AZD5363 or any drugs similar to it in structure or class"
- Non-query-able: "A bad reaction to AZD5363 or any drugs similar to it in structure or class"